clotting factor deficiency

The above is a clinical trial exclusion criterion. Annotated with entity spans:
[Condition: clotting factor deficiency]